有些淋巴球雖然能夠以較低的親和性認識自體抗原或與自體抗原極為類似的分子，卻也能夠逃過免疫系統自體耐受性（self-tolerance）的機轉而得以存在。這些淋巴球有何特性？
A. 一般不會產生自體免疫反應，只有在特殊狀況，如嚴重感染時會被活化
B. 一般會再循環至胸腺而被移除，因此並不引起自體免疫病變
C. 將接受細胞激素偏移作用（cytokine deviation）而由體內消失
D. 將由 AIRE（autoimmune regulator）基因的調控而引起胰臟胰島細胞（islet cells）的破壞

正確答案：A. 一般不會產生自體免疫反應，只有在特殊狀況，如嚴重感染時會被活化